Clinical trial exclusion criterion:
11. Any history of anaphylaxis or severe allergy resulting in angioedema; or a history of sensitivity/allergy to latex

Annotated entities:
- Condition: "anaphylaxis"
- Temporal: "history"
- Condition: "allergy"
- Qualifier: "severe"
- Condition: "angioedema"
- Temporal: "history"
- Condition: "sensitivity to latex"
- Condition: "allergy to latex"